¿Cuál de las siguientes enfermedades NO se asocia a sobrecrecimiento bacteriano intestinal?
1. Enfermedad celíaca.
2. Esclerosis sistémica.
3. Divertículos yeyunales.
4. Enteritis por radiación.

Respuesta correcta: 1. Enfermedad celíaca.